List fish anti-freeze proteins.

AFP-I
AFP-II
AFP-III
Anti-freeze glycoprotein
Thermal hysteresis protein